三叉神經下頜支（mandibular division of trigeminal nerve）受損，最可能影響下列何者之收縮？
A. 腭帆張肌（tensor veli palatini）
B. 腭帆提肌（levator veli palatini）
C. 腭咽肌（palatopharyngeus）
D. 腭舌肌（palatoglossus）

正確答案：A. 腭帆張肌（tensor veli palatini）